Hepatic insufficiency

The above is a clinical trial exclusion criterion. Annotated with entity spans:
[Condition: Hepatic insufficiency]